Clinical trial exclusion criterion:
Has received or is planned to receive toremifene and/or fusidic acid via IV administration within 24 hours before or within 24 hours after administration of study treatment.

Entity relations:
- Has_index("within 24 hours before administration of study treatment", "administration of study treatment")
- Has_index("within 24 hours after administration of study treatment", "administration of study treatment")
- Has_qualifier("toremifene", "IV administration")
- Has_temporal("toremifene", "within 24 hours before administration of study treatment")
- Has_mood("toremifene", "planned to")
- Has_index("within 24 hours after administration of study treatment", "administration of study treatment")
- OR("within 24 hours before administration of study treatment", "within 24 hours after administration of study treatment")
- OR("toremifene", "fusidic acid")